下列有關大腸憩室症（diverticulosis）的敘述，何者錯誤？
A. 大腸鏡檢查診斷最佳，大腸鋇劑造影檢查診斷率很低
B. 歐美地區憩室出現在左（下）側大腸最多，一旦憩室發炎，甚至有"左側闌尾炎＂之別稱
C. 有憩室症的患者，建議高纖維飲食，避免便秘
D. 大部分憩室是沒症狀的，最常見的併發症是出血及憩室炎

正確答案：A. 大腸鏡檢查診斷最佳，大腸鋇劑造影檢查診斷率很低